Clinical trial exclusion criterion:
Radiotherapy within 3 weeks of the first dose of 852A

Entity relations:
- AND("within 3 weeks of the first dose", "852A")
- Has_temporal("Radiotherapy", "within 3 weeks of the first dose")